Clinical trial inclusion criterion:
OR any FEV1 with chronic hypercapnia (baseline partial pressure of arterial carbon dioxide [PaCO2] > 45)

Annotated entities:
- Non-query-able: "OR any FEV1"
- Condition: "chronic hypercapnia"
- Measurement: "partial pressure of arterial carbon dioxide"
- Measurement: "PaCO2"
- Value: "> 45"